Señale la afirmación CORRECTA acerca del programa de tratamiento del trastorno negativista desafiante creado por Barkley:
1. Su principal ámbito de aplicación es el aula.
2. Hace un uso intensivo del modelado.
3. Se trata de un programa de entrenamiento de padres.
4. La comorbilidad con el TDAH desaconseja la aplicación de este programa.
5. Se compone de doce pasos.

Respuesta correcta: 3. Se trata de un programa de entrenamiento de padres.